Clinical trial inclusion criterion:
Overweight / obesity diagnostic criteria according to WHO-WPR

Annotated entities:
- Condition: "Overweight"
- Condition: "obesity"
- Qualifier: "WHO-WPR"